Los diagramas de flujo o flujogramas son representaciones gráficas de secuencias de operaciones, procedimientos o rutinas que sirven para el análisis de procesos o la toma de decisiones. Dichos diagramas emplean un conjunto de símbolos que son comunes a todo este tipo de representaciones y que tiene un significado concreto. En este sentido, como enfermera le han encargado la realización de un diagrama de flujo para representar una toma de decisión en la prestación de cuidados que se lleva a cabo en su unidad asistencial. Durante su diseño usted emplea el símbolo del rombo ( : señale el significado otorgado al símbolo del rombo en los diagramas de flujo:
1. Decisión.
2. Arrancar y parar.
3. Flujo.
4. Documento.

Respuesta correcta: 1. Decisión.